當一個B細胞產生的抗體由IgM轉變為IgG時，其機制為：
A. DNA重組（recombination）
B. RNA剪接（splicing）
C. 蛋白質裂解（degradation）
D. 新的基因表現（expression of a new gene）

正確答案：A. DNA重組（recombination）